Metabolic function, as follows: Serum Magnesium within normal limits. Serum Calcium within normal limits. Serum Potassium within normal limits.

The above is a clinical trial inclusion criterion. Annotated with entity spans:
Metabolic function, as follows: [Measurement: Serum Magnesium] [Value: within normal limits]. [Measurement: Serum Calcium] [Value: within normal limits]. [Measurement: Serum Potassium] [Value: within normal limits].